BUN = 50mg/dl

The above is a clinical trial inclusion criterion. Annotated with entity spans:
[Measurement: BUN] [Value: = 50mg/dl]